Clinical trial inclusion criterion:
Received BCR and/or BCL2 inhibitors were intolerant or had relapsed/refractory disease afterwards.

Annotated entities:
- Drug: "BCL2 inhibitors"
- Drug: "BCR inhibitors"
- Condition: "intolerant"
- Condition: "relapsed"
- Condition: "refractory disease"
- Temporal: "afterwards"